¿Cuál de las siguientes pruebas es más importante para el diagnóstico de las leucemias agudas?
1. Cariotipo.
2. Medulograma.
3. Hemograma.
4. PET.
5. Punción lumbar.

Respuesta correcta: 2. Medulograma.